History of seizure disorder

The above is a clinical trial exclusion criterion. Annotated with entity spans:
[Temporal: History] of [Condition: seizure disorder]